Traumatic pulmonary contusion or laceration

The above is a clinical trial exclusion criterion. Annotated with entity spans:
[Qualifier: Traumatic] [Condition: pulmonary contusion] or [Condition: laceration]